Clinical trial exclusion criteria:
Patients with liver cirrhosis, Hepatocellular Carcinoma or AFP >2 ULN or other malignancies.
Patients with other factors causing liver diseases.
Pregnant and lactating women.
Patients with concomitant HIV infection or congenital immune deficiency diseases.
Patients with diabetes, autoimmune diseases.
Patients with important organ dysfunctions.
Patients with serious complications (e.g., infection, hepatic encephalopathy, hepatorenal syndrome, gastrointestinal bleeding.)
Patients who receive antineoplastic or immunomodulatory therapy in the past 12 months.
Patients with a previous use of IFN anti hepatitis B virus treatment or have NAs drug resistance.
Patients who can't come back to clinic for follow-up on schedule.

Annotated entities:
- Condition: "liver cirrhosis"
- Condition: "Hepatocellular Carcinoma"
- Measurement: "AFP"
- Value: ">2 ULN"
- Condition: "malignancies"
- Condition: "liver diseases"
- Non-query-able: "Patients with other factors causing liver diseases"
- Pregnancy_considerations: "Pregnant and lactating women"
- Condition: "HIV infection"
- Qualifier: "concomitant"
- Condition: "congenital immune deficiency diseases"
- Condition: "diabetes"
- Condition: "autoimmune diseases"
- Condition: "organ dysfunctions"
- Qualifier: "important"
- Qualifier: "serious"
- Condition: "complications"
- Condition: "infection"
- Condition: "hepatic encephalopathy"
- Condition: "hepatorenal syndrome"
- Condition: "gastrointestinal bleeding"
- Procedure: "antineoplastic therapy"
- Procedure: "immunomodulatory therapy"
- Temporal: "past 12 months"
- Drug: "IFN"
- Qualifier: "anti hepatitis B virus"
- Condition: "resistance"
- Drug: "NAs drug"
- Post-eligibility: "Patients who can't come back to clinic for follow-up on schedule"